¿En cuál de los fármacos con actividad antiviral aparece la base púrica denominada guanina?
1. Lamivudina.
2. Zidovudina.
3. Ribavirina.
4. Aciclovir.
5. Didanosina.

Respuesta correcta: 4. Aciclovir.